Age > 18 years of age

The above is a clinical trial inclusion criterion. Annotated with entity spans:
[Person: Age] [Value: > 18 years of age]